What does RUNX1T1 stand for?

RUNX1T1 stands for runt-related transcription factor 1.